El manejo de las convulsiones en un paciente, dentro de la fase ictal, incluye actividades como tranquilizarle, protegerle de lesiones, administrar la medicación prescrita y mantener la vía aérea permeable, entre otras. Pero, además, es fundamental:
1. Introducir cualquier objeto en la boca del paciente.
2. Poner los dedos en la boca para intentar mantenerla abierta.
3. No perder el tiempo en la instauración de una vía venosa, porque en ningún caso será necesaria.
4. No introducir a la fuerza ningún objeto en la boca.
5. Proceder a la intubación nasotraqueal, siempre y en todos los casos.

Respuesta correcta: 4. No introducir a la fuerza ningún objeto en la boca.